¿Qué caracteriza a las técnicas objetivas de evaluación psicofisiológica?
1. Son pruebas con una elevada validez ecológica.
2. Los factores ambientales (p.e. luz, temperatura) pueden afectar a la fiabilidad del registro.
3. Los sujetos ansiosos suelen tener un mismo nivel de activación que los no ansiosos.
4. Los sujetos con distintos trastornos de ansiedad suelen tener similares patrones de activación a nivel basal.
5. Los sujetos con distintos trastornos de ansiedad suelen tener similares respuestas ante diferentes estímulos.

Respuesta correcta: 2. Los factores ambientales (p.e. luz, temperatura) pueden afectar a la fiabilidad del registro.